某研究想探討吸菸與肺功能值的關係，將受試者依吸菸狀況分為五組：①本人不吸菸工作環境也無人吸菸② 本人不吸菸但工作環境很多人吸菸③本人吸菸程度輕微④本人吸菸程度中等⑤本人吸菸程度嚴重。每組找 100人，測量每個人的某肺功能指標。假如我們要檢定這五種吸菸狀況下的肺功能平均值是否不同，下列那
 一種統計分析方法最適當？
A. 獨立t檢定
B. 配對t檢定
C. 皮爾森氏卡方檢定
D. 單因子變異數分析

正確答案：D. 單因子變異數分析